¿Cuál es la edad de mayor riesgo para la aparición de trastorno depresivo mayor?:
1. Infancia.
2. Adolescencia.
3. Jóvenes adultos (25-45 años).
4. Vejez (a partir de 70 años).

Respuesta correcta: 3. Jóvenes adultos (25-45 años).